¿Qué se entiende por “gestión clínica”, como concepto vinculado a la gestión sanitaria?:
1. La responsabilidad de los profesionales sanitarios en la utilización de los recursos y la introducción de los correspondientes mecanismos de financiación.
2. La gestión asistencial de las áreas no quirúrgicas de los hospitales.
3. La función de la gestión hospitalaria que se ocupa específicamente de supervisar las retribuciones y demás condiciones de trabajo de los profesionales sanitarios.
4. La coordinación asistencial de los centros de atención primaria y especializada dentro de un área de salud.
5. La gestión de la actividad asistencial de un Servicio o Unidad, sin tener en cuenta la gestión de los recursos, ni los procedimientos administrativos, ni cualquier otra consideración que no sea la propia actividad asistencial.

Respuesta correcta: 1. La responsabilidad de los profesionales sanitarios en la utilización de los recursos y la introducción de los correspondientes mecanismos de financiación.